What year was the first successful human heart transplant performed?

The first human heart transplant in 1967 was performed using a deceased donor heart,